Ductal carcinoma in situ (DCIS; stage 0 cancer),

The above is a clinical trial exclusion criterion. Annotated with entity spans:
[Condition: Ductal carcinoma in situ] ([Condition: DCIS]; [Measurement: stage] [Value: 0] [Condition: cancer]),